Which transcription factor binding site is contained in Alu repeats?

A novel abundant NF-κB-binding site resides in specialized Alu-repetitive elements having the potential for long range transcription regulation, thus suggesting that in addition to its known role, NF-κB has a primate-specific function and a role in human evolution.